下列關於孕婦外傷的敘述何者錯誤？
A. 拯救胎兒的第一要件是急救及穩定孕婦的生命徵象
B. 因為懷孕後血量增加，孕婦可能已有相當多的失血量，卻沒有明顯的休克徵象
C. 若孕婦呈現休克現象，可左側躺以減少下腔靜脈的壓迫，增加回心血量
D. 因為胎盤充滿含氧血，即使孕婦已經失血休克，胎兒仍不易立即缺氧

正確答案：D. 因為胎盤充滿含氧血，即使孕婦已經失血休克，胎兒仍不易立即缺氧